有關太田母斑（nevus of Ota）的敘述，下列何者錯誤？
A. 好發於臉上三叉神經第三分支部位
B. 可伴隨同側之眼鞏膜黑藍色斑
C. 通常是單側病變
D. 好發於東方女性

正確答案：A. 好發於臉上三叉神經第三分支部位